Clinical trial inclusion criterion:
Patients with major depressive disorder according to DSM-IV criteria that have lasted >8 weeks

Entity relations:
- AND("DSM-IV criteria", "major depressive disorder")
- Has_temporal("major depressive disorder", "lasted >8 weeks")